Application of preparations of immune globulin or blood transfusion within last three months prior to clinical studies;

The above is a clinical trial exclusion criterion. Annotated with entity spans:
Application of [Drug: preparations of immune globulin] or [Procedure: blood transfusion] [Temporal: within last three months prior to clinical studies];